breastfeeding

The above is a clinical trial exclusion criterion. Annotated with entity spans:
[Observation: breastfeeding]